Liver or kidney failure.

The above is a clinical trial exclusion criterion. Annotated with entity spans:
[Condition: Liver] or [Condition: kidney failure].